1. Presence of other neoplasia

The above is a clinical trial exclusion criterion. Annotated with entity spans:
[Parsing_Error: 1.] Presence of [Qualifier: other] [Condition: neoplasia]